Use of strong CYP3A4/P-glycoprotein inhibitors (specifically ritonavir, ketoconazole, clarithromycin, cyclosporine, diltiazem and verapamil)

The above is a clinical trial exclusion criterion. Annotated with entity spans:
Use of [Drug: strong CYP3A4/P-glycoprotein inhibitors] (specifically [Drug: ritonavir], [Drug: ketoconazole], [Drug: clarithromycin], [Drug: cyclosporine], [Drug: diltiazem] and [Drug: verapamil])